Clinical trial exclusion criterion:
Patients with azathioprine or biologics therapy

Annotated entities:
- Drug: "azathioprine"
- Drug: "biologics"
- Procedure: "therapy"